Clinical trial exclusion criterion:
Chronic disease: renal, liver, cardiac, malignancy

Annotated entities:
- Condition: "renal malignancy"
- Condition: "cardiac malignancy"
- Condition: "liver malignancy"
- Condition: "Chronic disease"
- Undefined_semantics: "Chronic disease"